六歲男童最近兩週內常會半夜起來上廁所，其體重於最近兩週內減少一公斤。病人因全身無力而就診，身體檢查除輕度脫水外並無其他異常。實驗室檢查顯示血糖值 610 mg/dL，pH 7.17，paCO2 39.2 mmHg，paO2  mmHg，HCO3- 13.9 mEq/L，BE -14.2 mEq/L，Na+ 131 mmol/L，K+ 4.5 mmol/L，Cl- 98 mmol/L。下列那一項治療對此病人而言並非必要的處置？
A. 補充水分（hydration）
B. 補充胰島素（insulin）
C. 給予鉀離子（potassium）
D. 給予重碳酸鈉（sodium bicarbonate）

正確答案：D. 給予重碳酸鈉（sodium bicarbonate）